下列何者不是臺灣目前新生兒篩檢有檢驗的項目？
A. 先天性甲狀腺低功能症
B. 苯酮尿症
C. 乙型地中海型貧血
D. 甲基丙二酸血症（methylmalonic acidemia）

正確答案：C. 乙型地中海型貧血